Subjects participating another interventional clinical trial within 30 days prior to screening.

The above is a clinical trial exclusion criterion. Annotated with entity spans:
[Competing_trial: Subjects participating another interventional clinical trial within 30 days prior to screening.]